Clinical trial exclusion criterion:
Stent placement within the previous 6 months

Entity relations:
- AND("placement", "Stent")
- Has_temporal("placement", "within the previous 6 months")